Clinical trial inclusion criterion:
Subjects must weigh at least 110 pounds (50 kg), but not to present obesity (BMI < 32kg/m2).

Entity relations:
- Subsumes("at least 110 pounds", "at least 50 kg")
- Has_value("weigh", "at least 110 pounds")
- Has_negation("obesity", "not to present")
- Has_value("BMI", "< 32kg/m2")
- Subsumes("obesity", "BMI")